Clinical trial inclusion criterion:
Patients' curator must be able to give voluntary consent.

Annotated entities:
- Non-query-able: "Patients' curator must be able to give voluntary consent"
- Post-eligibility: "Patients' curator must be able to give voluntary consent"